What is the route of administration of apixaban?

Apixaban is administered orally.